下列病毒感染誘發寄主產生干擾素（interferon）之敘述，何者正確？
A. 病毒 DNA 是誘發干擾素產生之最佳物質
B. 當體內干擾素製造不足時，會降低病毒感染的嚴重性
C. 干擾素可調節輔助性 T 細胞增加免疫系統和毒殺性 T 細胞對感染細胞的確認，並予以殲滅
D. 干擾素在病毒感染之晚期才被釋放出來

正確答案：C. 干擾素可調節輔助性 T 細胞增加免疫系統和毒殺性 T 細胞對感染細胞的確認，並予以殲滅